Clinical trial exclusion criterion:
Mental disorders preventing the subject to understand the project description.

Entity relations:
- Has_qualifier("Mental disorders", "preventing the subject to understand the project description")